Lactating patients

The above is a clinical trial exclusion criterion. Annotated with entity spans:
[Condition: Lactating] patients